Clinical trial exclusion criterion:
Neovascularization > 0.75 mm in from of the limbus

Entity relations:
- Has_value("Neovascularization", "> 0.75 mm in from of the limbus")